臨床醫學研究時需考量的倫理議題，下列何者錯誤？
A. 若已有有效的標準治療方式，就不該使用安慰劑作對照組
B. 由尊重人格原則可導出「應取得知情同意」之概念
C. 由行善原則可導出應公平地挑選受試者
D. 未經受試者同意即逕行試驗乃違反醫療法規

正確答案：C. 由行善原則可導出應公平地挑選受試者